Clinical trial exclusion criterion:
<18 years of age

Entity relations:
- Has_value("age", "<18 years")